Patient is receiving chronic oral anticoagulation therapy (i.e., vitamin K antagonist, direct thrombin inhibitor, Factor Xa inhibitor)

The above is a clinical trial inclusion criterion. Annotated with entity spans:
Patient is receiving [Multiplier: chronic] [Procedure: oral anticoagulation therapy] (i.e., [Drug: vitamin K antagonist], [Drug: direct thrombin inhibitor], [Drug: Factor Xa inhibitor])